What is the role of Adamts18 in hormone receptor signaling?

The secreted protease Adamts18 links hormone action to activation of the mammary stem cell niche. Adamts18 is required for stem cell activation, has multiple binding partners in the basement membrane and interacts with the basal membrane-specific proteoglycan, Col18a1.